Any concomitant cardiovascular procedure to CABG (i.e. valve, aortic or carotid surgery)

The above is a clinical trial exclusion criterion. Annotated with entity spans:
Any [Temporal: concomitant] [Procedure: cardiovascular procedure] to [Procedure: CABG] (i.e. [Procedure: valve], [Procedure: aortic] or [Procedure: carotid surgery])